Which genes are the main markers of primitive Endoderm (prEN) formation?

The genes which are the main markers of primitive Endoderm (prEN) formation are fgf4, lrp2, gata4, pdgfra, pDgfrα, gATA6, nanog, p dgfralpha, egam1 and dab2.